Clinical trial exclusion criterion:
severe hepatic impairment

Entity relations:
- Has_qualifier("hepatic impairment", "severe")